張先生，65 歲，為乙型肝炎病毒帶原患者。因有慢性肝炎，醫師建議每 3-4 個月接受血液肝功能檢測以及腹部超音波檢查。最近腹部超音波檢查發現肝右葉有一高低回音混雜之腫瘤，腫瘤大小約 5 公分。血液甲型胎兒蛋白濃度是 4820 ng/mL。醫師初步之診斷是肝細胞癌，建議張先生接受手術治療。身體檢查，張先生神智清楚，治療前之檢測值血清白蛋白值為 4.2 g/dL，總膽紅素為 0.8 mg/dL，凝血時間（prothrombin time）是 9 秒，無腹水。根據 Child-Pugh 對肝功能之分類，張先生應該是屬於下列那一種？
A. Child-Pugh A
B. Child-Pugh B
C. Child-Pugh C
D. Child-Pugh D

正確答案：A. Child-Pugh A